Which genes are associated with Epidermolysis Bullosa Simplex?

Epidermolysis bullosa simplex (EBS) is a rare genodermatosis resulting from multiple gene mutations, including KRT5 and KRT14.